Clinical trial exclusion criterion:
Diagnosis of type 1 diabetes mellitus (DM) or uncontrolled DM (patients on insulin therapy or with HbA1c > 9%)

Annotated entities:
- Condition: "type 1 diabetes mellitus (DM)"
- Qualifier: "uncontrolled"
- Condition: "DM"
- Procedure: "insulin therapy"
- Measurement: "HbA1c"
- Value: "> 9%"